Clinical trial exclusion criterion:
Known. acyanotic congenital heart disease or children after cardiac interventional procedures for follow-up examination.

Annotated entities:
- Condition: "acyanotic congenital heart disease"
- Person: "children"
- Temporal: "after cardiac interventional procedures"
- Reference_point: "cardiac interventional procedures"
- Procedure: "cardiac interventional procedures"
- Procedure: "follow-up examination"
- Qualifier: "for follow-up examination"